下列有關乳房保留手術（breast conserving surgery）的敘述，何者正確？
A. 術後之放射線治療，只須視腫瘤侵犯程度決定
B. 切除邊緣若存有乳癌細胞，可不需要進一步手術處置，以放射治療殺死殘餘細胞即可
C. 若經再次切除仍無法獲得乾淨之切除邊緣，則須考慮全乳房切除
D. 4 公分以上之乳癌已經被證實可安全施行乳房保留手術治療

正確答案：C. 若經再次切除仍無法獲得乾淨之切除邊緣，則須考慮全乳房切除